Clinical trial inclusion criterion:
Eastern Cooperative Oncology Group score 0-2

Annotated entities:
- Measurement: "Eastern Cooperative Oncology Group"
- Value: "score 0-2"